En la oncocercosis el vector es:
1. Mosca negra (género Simulium).
2. Garrapata.
3. Gasterópodos acuáticos.
4. Piojos.

Respuesta correcta: 1. Mosca negra (género Simulium).